HBV DNA < 200 IU/ml during nucleos(t)ide analogue (except Telbivudine) treatment within one month prior to initiation of peginterferon alfa-2a

The above is a clinical trial inclusion criterion. Annotated with entity spans:
[Measurement: HBV DNA] [Value: < 200 IU/ml] [Temporal: during nucleos(t)ide analogue (except Telbivudine) treatment] [Temporal: within one month prior to initiation of peginterferon alfa-2a]